2 天大男嬰，出生後因發紺（cyanosis），及呼吸急促轉送醫院。身體檢查，呼吸次數每分鐘 55 次，稍合併胸凹現象；四肢血壓並無明顯差異，約為 63/40 mmHg；但上半身血氧濃度 62 %，下半身血氧濃度 88 %。下列何者為最可能之診斷？
A. 心臟下型之總肺靜脈回流異常（TAPVR, infra-cardiac type）
B. B 型主動脈弓中斷合併心室中膈缺損（interrupted aortic arch type B with VSD）
C. 主動脈弓窄縮（coarctation）合併心室中膈缺損（VSD）
D. 單純大血管轉位合併開放性導管及小的心房間血流交通（simple TGA, PDA, a restricted atrial shunt）

正確答案：D. 單純大血管轉位合併開放性導管及小的心房間血流交通（simple TGA, PDA, a restricted atrial shunt）